Neutrophil count <1500 cells/mm3 or platelet count <90,000 cells/mm3 at screening.

The above is a clinical trial exclusion criterion. Annotated with entity spans:
[Measurement: Neutrophil count] [Value: <1500 cells/mm3] or [Measurement: platelet count] [Value: <90,000 cells/mm3] [Temporal: at screening].